Clinical trial exclusion criterion:
Prostatitis

Annotated entities:
- Condition: "Prostatitis"